Clinical trial exclusion criterion:
Culture-documented or suspected bacterial or viral infection of the upper or lower respiratory tract, sinus or middle ear that is not resolved within 4 weeks of Visit 1 and led to a change in asthma management or, in the opinion of the Investigator, is expected to affect the subject's asthma status or the subject's ability to participate in the study.

Annotated entities:
- Condition: "viral infection of the upper respiratory tract"
- Condition: "bacterial infection of the upper respiratory tract"
- Condition: "viral infection of the lower respiratory tract"
- Condition: "bacterial infection of the lower respiratory tract"
- Condition: "viral infection of the sinus"
- Condition: "bacterial infection of the sinus"
- Condition: "viral infection of the middle ear"
- Condition: "bacterial infection of the middle ear"
- Procedure: "Culture"
- Observation: "suspected"
- Qualifier: "resolved"
- Negation: "not"
- Temporal: "within 4 weeks of Visit 1"
- Reference_point: "Visit 1"
- Observation: "change in asthma management"
- Subjective_judgement: "in the opinion of the Investigator"
- Non-query-able: "is expected to affect"
- Subjective_judgement: "subject's ability to participate in the study"
- Non-query-able: "subject's ability to participate in the study"
- Procedure: "asthma management"